下列有關Campylobacter upsaliensis之敘述，何者錯誤？
A. 主要由接觸飼養的貓狗所感染
B. 與Guillain-Barré syndrome無關
C. 細胞形態似Helicobacter pylori
D. 屬微氧需求菌

正確答案：B. 與Guillain-Barré syndrome無關